Clinical trial inclusion criterion:
High risk for cardiac surgery (STS and logistic Euroscore ),

Annotated entities:
- Qualifier: "High risk"
- Procedure: "cardiac surgery"
- Qualifier: "STS"
- Qualifier: "logistic Euroscore"